Person was never fitted with microprocessor controlled prosthetic knee joint.

The above is a clinical trial inclusion criterion. Annotated with entity spans:
Person was [Negation: never] fitted with [Qualifier: microprocessor controlled] [Device: prosthetic knee joint].